Encontrándose de guardia médica en el Servicio de Urgencias de su hospital, tiene que atender a un paciente de 64 años de edad con insuficiencia respiratoria aguda. Su estado clínico es crítico, con baja saturación de oxígeno e inestabilidad hemodinámica. Se realiza Rx urgente de tórax que muestra atelectasia de 2/3 del pulmón derecho. Se procede a intubación orotraqueal y ventilación en modo asistido, con FiO2 de 1,0. En una gasometría arterial practicada posteriormente obtenemos estos valores: pH 7,23; PaO2 60 mmHg y PaCO2 30 mmHg. ¿Cuál es la causa de la hipoxemia?:
1. Cortocircuito.
2. Hipoventilación.
3. Baja presión de O2 inspirado.
4. Enfermedad neuromuscular.

Respuesta correcta: 1. Cortocircuito.